下列何者與第一型過敏反應（Hypersensitivity reaction）的關係較為密切？
A. IgA
B. IgE
C. IgG
D. IgM

正確答案：B. IgE